Clinical trial exclusion criterion:
Patients that require emergent release of a RBC transfusion and in whom emergency randomization could not be completed

Entity relations:
- Has_qualifier("RBC transfusion", "emergent release")
- Has_mood("RBC transfusion", "require")
- Has_negation("emergency randomization", "could not be completed")